下列引起消化性潰瘍（peptic ulcer）的各種病因中，何者為 1980 年代發現的重要病因？此項發現並且榮獲 2005 年諾貝爾生理學醫學獎。
A. 胃酸和胃蛋白酶過多
B. 黏膜的血流供給不足
C. 黏膜的黏液分泌不足
D. 幽門螺旋桿菌感染

正確答案：D. 幽門螺旋桿菌感染